Clinical trial exclusion criteria:
Receipt of DTaP, IPV, PCV13, or Hib prior to enrollment. Previous administration of the first dose of HBV is permitted
Anticipated receipt of any vaccine other than DTaP, IPV, HBV, PCV13, or Hib during the first 60 hours after randomization
History of a severe allergic reaction (e.g. anaphylaxis) to a previous dose of any hepatitis B vaccine
History of a severe allergic reaction (e.g. anaphylaxis) to any component of the vaccines used in the study including neomycin, yeast and polymyxin B
History of latex allergy
History of unstable progressive neurologic disorder of unknown cause
Known cause of apnea other than apnea of prematurity
Cyanotic heart disease (congenital or acquired)
Child or parent/LAR is an immediate relative of study staff or an employee who is supervised by study staff.
Any condition that would, in the opinion of the site investigator, place the participant at an unacceptable risk of injury or render the participant unable to meet the requirements of the protocol

Annotated entities:
- Drug: "DTaP"
- Drug: "IPV"
- Drug: "PCV13"
- Drug: "Hib"
- Temporal: "prior to enrollment"
- Reference_point: "enrollment"
- Drug: "DTaP"
- Drug: "IPV"
- Drug: "HBV"
- Drug: "PCV13"
- Drug: "Hib"
- Mood: "Anticipated receipt"
- Temporal: "during the first 60 hours after randomization"
- Reference_point: "randomization"
- Qualifier: "severe"
- Condition: "allergic reaction"
- Condition: "anaphylaxis"
- Drug: "hepatitis B vaccine"
- Temporal: "previous"
- Qualifier: "severe"
- Condition: "allergic reaction"
- Condition: "anaphylaxis"
- Drug: "component of the vaccines used in the study"
- Drug: "neomycin"
- Drug: "polymyxin B"
- Drug: "yeast"
- Condition: "allergy"
- Drug: "latex"
- Temporal: "History"
- Condition: "progressive neurologic disorder"
- Qualifier: "unknown cause"
- Qualifier: "unstable"
- Temporal: "History"
- Condition: "Known cause of apnea"
- Condition: "apnea of prematurity"
- Negation: "other than"
- Condition: "Cyanotic heart disease"
- Qualifier: "congenital"
- Qualifier: "acquired"
- Non-query-able: "Child or parent/LAR is an immediate relative of study staff or an employee who is supervised by study staff."
- Non-query-able: "Any condition that would, in the opinion of the site investigator, place the participant at an unacceptable risk of injury or render the participant unable to meet the requirements of the protocol"